Clinical trial exclusion criterion:
Inability to give informed consent

Annotated entities:
- Post-eligibility: "Inability to give informed consent"